Clinical trial exclusion criterion:
Patients who received anti-hair loss treatment within the past six months.

Entity relations:
- Has_temporal("anti-hair loss treatment", "within the past six months")